lack of serious hearing and vision impairment and be able to read so that neurobehavioral tests can be performed.

The above is a clinical trial inclusion criterion. Annotated with entity spans:
[Negation: lack of] serious [Condition: hearing] and [Condition: vision impairment] and be [Condition: able to read] so that [Procedure: neurobehavioral tests] [Mood: can be performed].